一種體染色體顯性（autosomal dominant）遺傳疾病稱為familial hyper-cholesterolemia乃是因為low density lipoprotein（LDL）receptor突變所致。下列有關LDL的敘述，何者正確？
A. LDL receptor只存在肝細胞上
B. LDL中的膽固醇經由LDL receptor之作用，可提供肝細胞合成bile salts
C. LDL所含的脂肪以triglyceride為主
D. LDL是直接由肝臟製造分泌

正確答案：B. LDL中的膽固醇經由LDL receptor之作用，可提供肝細胞合成bile salts